下列有關大腸直腸息肉的敘述，何者錯誤？
A. 最常見的良性息肉是增生性息肉（hyperplastic polyp）
B. 最有癌化危險性（malignant potential）的是絨毛狀腺瘤（villous adenoma）
C. 結腸息肉症合併口腔黏膜及掌心黑色斑點者為 Gardner's syndrome
D. 小於 1 公分的腺性息肉（adenomatous polyp）之惡性機率小於 5%

正確答案：C. 結腸息肉症合併口腔黏膜及掌心黑色斑點者為 Gardner's syndrome